Clinical trial exclusion criterion:
Stroke, transient ischemic attack, acute coronary syndrome, or hospitalization for heart failure worsening, within the previous 30 days.

Entity relations:
- Has_qualifier("heart failure", "worsening")
- AND("hospitalization", "heart failure")
- Has_temporal("Stroke", "within the previous 30 days")
- OR("Stroke", "hospitalization", "transient ischemic attack", "acute coronary syndrome")